Clinical trial exclusion criterion:
Being or attempting to become pregnant during study follow-up

Annotated entities:
- Pregnancy_considerations: "Being or attempting to become pregnant during study follow-up"